嬰兒建立輸液管道有下列幾種方式，何者最不適用？
A. 頭皮靜脈（scalp vein）
B. 骨內注射（intraosseous infusion）
C. 臍動脈（umbilical artery）
D. 靜脈切開（venous cutdown）

正確答案：C. 臍動脈（umbilical artery）